假設有一個城市正在流行A型流行性感冒，10% 的家庭媽媽有感染，10% 的家庭爸爸有感染，2% 的家庭爸媽同時感染，若A 事件為媽媽有感染，B事件為爸爸有感染，則P（A|B）＝？
A. 0.1
B. 0.002
C. 0.2
D. 0.005

正確答案：C. 0.2